hysterectomy

The above is a clinical trial inclusion criterion. Annotated with entity spans:
[Procedure: hysterectomy]